Clinical trial inclusion criteria:
satisfying DSM-V criteria for ED and for half of the patients in addition
have a history of childhood trauma.

Annotated entities:
- Measurement: "DSM-V criteria"
- Value: "satisfying"
- Condition: "ED"
- Parsing_Error: "and for half of the patients in addition"
- Condition: "childhood trauma"
- Temporal: "history"